Clinical trial inclusion criterion:
Provision of signed and dated, written informed consent prior to any study specific procedures, sampling and analyses.

Annotated entities:
- Post-eligibility: "Provision of signed and dated, written informed consent prior to any study specific procedures, sampling and analyses."
- Non-query-able: "Provision of signed and dated, written informed consent prior to any study specific procedures, sampling and analyses."